抽取病人之痰中可能會出現之寄生蟲有那些？①衛氏肺吸蟲蟲卵 ②糞小桿線蟲幼蟲 ③蛔蟲蟲卵 ④衛氏肺吸蟲幼蟲
A. ①＋②
B. ②＋③
C. ③＋④
D. ①＋④

正確答案：A. ①＋②